Most recent hCG > 5000 mIU/mL

The above is a clinical trial exclusion criterion. Annotated with entity spans:
[Temporal: Most recent] [Measurement: hCG] [Value: > 5000 mIU/mL]